Which organs are mostly affected in Systemic Lupus Erythematosus (SLE)?

In systemic lupus erythematosus (SLE), brain and kidney are the most frequently affected organs. The heart is one of the most frequently affected organs in SLE. Skin is one of the most commonly affected organs in SLE